下列何者為使用sulfonamides最常見副作用？
A. 神經症狀如頭痛及嗜睡
B. 新生兒黃疸
C. 皮膚過敏反應
D. 肝炎

正確答案：C. 皮膚過敏反應